Clinical trial inclusion criterion:
Performed spirometry at Visit 1 and Visit 2 and willing to perform spirometry at Visit 3

Annotated entities:
- Procedure: "spirometry"
- Temporal: "at Visit 1"
- Temporal: "at Visit 2"
- Temporal: "at Visit 3"
- Mood: "willing to perform"
- Procedure: "spirometry"
- Reference_point: "Visit 1"
- Reference_point: "Visit 2"
- Reference_point: "Visit 3"